Clinical trial inclusion criterion:
Diagnosis of DM type 2 with A1-C >7 to 15

Entity relations:
- Has_value("A1-C", ">7 to 15")
- AND("DM type 2", "A1-C")